For which type of cancer can uc.189 be used as a potential prognostic biomarker?

ESCC